一位正常發育之 6 歲男孩，在發燒後（體溫超過 39℃）有意識喪失，四肢抽搐，兩眼上吊，嘴唇發黑之發作，約 3 分鐘後意識恢復，無任何神經及活動的異常現象。針對此孩童之此第 1 次發作，下列那一項對父母親的解釋是錯誤的？
A. 需要進行 EEG 檢查
B. 有可能不是單純性的 febrile convulsion
C. 有必要馬上進行腦部影像檢查
D. 未來有可能再次無預警發生類似發作

正確答案：C. 有必要馬上進行腦部影像檢查